Clinical trial inclusion criterion:
At least one episode of AF must be documented during the prior year by any kind of ECG recording.

Entity relations:
- Has_multiplier("episode", "At least one")
- AND("AF", "episode")
- AND("ECG", "episode")
- Has_temporal("episode", "prior year")